肩胛上切迹（suprascapular notch）處的肩胛上神經（suprascapular nerve)受傷時，那兩塊肌肉會直接受到影響？
A. 棘下肌（infraspinatus）與小圓肌（teres minor）
B. 三角肌（deltoid muscle）與小圓肌（teres minor）
C. 棘上肌（supraspinatus）與棘下肌（infraspinatus）
D. 棘上肌（supraspinatus）與肩胛下肌（subscapularis）

正確答案：C. 棘上肌（supraspinatus）與棘下肌（infraspinatus）